Meet Diagnostic and Statistical Manual version IV (DSM-IV) criteria for alcohol dependence or & DSM-V criteria for alcohol use disorder, severe.

The above is a clinical trial inclusion criterion. Annotated with entity spans:
Meet [Qualifier: Diagnostic and Statistical Manual version IV (DSM-IV) criteria] for [Condition: alcohol dependence] or & [Qualifier: DSM-V criteria] for [Condition: alcohol use disorder], [Qualifier: severe].